Clinical trial exclusion criterion:
5. Currently taking immunomodulatory medication, i.e. interferon.

Entity relations:
- Subsumes("immunomodulatory medication", "interferon")